Clinical trial exclusion criterion:
Peripheral neuropathy

Annotated entities:
- Condition: "Peripheral neuropathy"